在病人上身直立姿勢進行肋膜穿刺術時，下列那一個位置最有可能刺傷肺臟？
A. 鎖骨中線（midclavicular line）第8肋間
B. 肩胛線（scapular line）第9肋間
C. 腋中線（midaxillary line）第9肋間
D. 胸椎旁第10肋間

正確答案：B. 肩胛線（scapular line）第9肋間